Las células de Müller de la retina son:
1. Neuronales modificadas.
2. Glandulares.
3. Neurogliales de soporte.
4. De la microglía.
5. De la capa pigmentaria.

Respuesta correcta: 3. Neurogliales de soporte.